Which is the primary interacting protein of BLK?

Genetic and physical interaction of the B-cell systemic lupus erythematosus-associated genes BANK1 and BLK.